Clinical trial exclusion criterion:
History of chronic diarrhea (lasting for more than 2 weeks in the past 6 months)

Annotated entities:
- Condition: "chronic diarrhea"
- Temporal: "History"
- Multiplier: "lasting for more than 2 weeks"
- Temporal: "in the past 6 months"